下列有關醫療需求價格彈性之敘述，何者正確？
A. 住院服務價格彈性較門診為高
B. 牙醫服務價格彈性較西醫為高
C. 護理之家價格彈性較急性住院服務為低
D. 醫療服務價格彈性較一般服務為高

正確答案：B. 牙醫服務價格彈性較西醫為高